Clinical trial exclusion criterion:
body mass index > 35

Annotated entities:
- Measurement: "body mass index"
- Value: "> 35"